Clinical trial exclusion criterion:
Subject has known cryoglobulinaemia. General exclusion criteria

Annotated entities:
- Condition: "cryoglobulinaemia"